American Society of Anesthesiologist (ASA) status 4 or higher.

The above is a clinical trial exclusion criterion. Annotated with entity spans:
[Measurement: American Society of Anesthesiologist (ASA) status] [Value: 4 or higher].